Clinical trial exclusion criterion:
Low vitamin B12 Levels (< 300 pg/mL)

Annotated entities:
- Measurement: "vitamin B12 Levels"
- Value: "< 300 pg/mL"